Clinical trial inclusion criterion:
Patients with a histologically or cytologically proven diagnosis of NSCLC

Entity relations:
- Has_qualifier("NSCLC", "histologically proven")
- OR("histologically proven", "cytologically proven")